66 人類主要組織相容抗原（HLA）表現型為 A1, A3, B7, B27, DR1, DR3 的人所產生的毒殺性 T 細胞 （Cytotoxic T cell）可毒殺受病毒感染的細胞，則該感染細胞最可能表現下列何種分子？
A. A3
B. B8
C. DR1
D. CD8

正確答案：A. A3